En una población el 60% de los habitantes son hombres. La variable aleatoria “número de hombres en un grupo de 10 personas” sigue una distribución de tipo:
1. Binomial.
2. Chi-cuadrado.
3. Poisson.
4. Normal.
5. t de Student.

Respuesta correcta: 1. Binomial.